Cannot stand general anesthesia

The above is a clinical trial exclusion criterion. Annotated with entity spans:
[Observation: Cannot stand] [Procedure: general anesthesia]